Clinical trial exclusion criterion:
Current use of gabapentin or pregabalin

Annotated entities:
- Drug: "gabapentin"
- Temporal: "Current"
- Drug: "pregabalin"